Clinical trial exclusion criterion:
Inability to lie flat for 20-30 minutes (the anticipated amount of time to complete the MRI procedure)

Entity relations:
- Has_qualifier("Inability to lie flat", "20-30 minutes")
- Subsumes("20-30 minutes", "amount of time to complete the MRI procedure")